C-reactive protein > 15 mg/l (three fold higher than the upper limit of normal)

The above is a clinical trial inclusion criterion. Annotated with entity spans:
[Measurement: C-reactive protein] [Value: > 15 mg/l] ([Value: three fold higher than the upper limit of normal])